(6)Significant signs of abnormalities as seen in laboratory tests or physical characteristics, which, at the discretion of the investigators, indicates that the patient is experiencing a serious illness or, may affect the observation and evaluation of the drug's efficacy or adverse events, or renders the patient unsuitable for participating in this study;

The above is a clinical trial exclusion criterion. Annotated with entity spans:
(6)[Qualifier: Significant] [Condition: signs of abnormalities] as seen in [Measurement: laboratory tests] [Non-representable: or physical characteristics, which, at the discretion of the investigators, indicates that the patient is experiencing a serious illness or, may affect the observation and evaluation of the drug's efficacy or adverse events, or renders the patient unsuitable for participating in this study;]